Clinical trial exclusion criterion:
History of kidney transplant

Entity relations:
- Has_temporal("kidney transplant", "History")